Clinical trial exclusion criterion:
Patients with a history of, or at imminent risk for, colectomy; who required gastrointestinal surgery within 2 months before screening;

Annotated entities:
- Procedure: "gastrointestinal surgery"
- Temporal: "within 2 months before screening"
- Procedure: "colectomy"
- Mood: "imminent risk for"
- Temporal: "history of"